下列何者不是經前症候群（PMS）常見的症狀？
A. 乳房脹痛（mastalgia）
B. 頭痛（headache）
C. 躁症（mania）
D. 心情低落（depression）

正確答案：C. 躁症（mania）